Clinical trial inclusion criterion:
Corneal ulcer that is smear positive for either bacteria or filamentous fungus

Annotated entities:
- Condition: "Corneal ulcer"
- Measurement: "smear"
- Qualifier: "bacteria"
- Qualifier: "filamentous fungus"
- Value: "positive"